History of bladder irradiation

The above is a clinical trial exclusion criterion. Annotated with entity spans:
[Temporal: History] of [Condition: bladder irradiation]